La fracción glucídica de los glicolípidos de la membrana de las células eucarióticas:
1. Se localiza en la cara citoplasmática de la membrana.
2. Tiene siempre ácido siálico.
3. Se sintetizan por acción de varias glicosil transferasas.
4. Es un oligómero de gluocosa.
5. No tiene poder antigénico.

Respuesta correcta: 3. Se sintetizan por acción de varias glicosil transferasas.